Surgeries that include: intradetrusor Botox, vaginal mesh excision, and fistula repair

The above is a clinical trial exclusion criterion. Annotated with entity spans:
Surgeries that include: [Qualifier: intradetrusor] [Drug: Botox], [Procedure: vaginal mesh excision], and [Procedure: fistula repair]